Clinical trial inclusion criterion:
37 weeks gestation or greater

Annotated entities:
- Condition: "gestation"
- Value: "37 weeks greater"